Clinical trial exclusion criterion:
Estimated GFR (eGFR) < 60 mL/min/1.73 m2 and blood glucose > 135 mg/dl; Past or present history of acute renal failure, renal dialysis, diabetes mellitus.

Annotated entities:
- Measurement: "Estimated GFR"
- Measurement: "eGFR"
- Value: "< 60 mL/min/1.73 m2"
- Measurement: "blood glucose"
- Value: "> 135 mg/dl"
- Condition: "acute renal failure"
- Procedure: "renal dialysis"
- Condition: "diabetes mellitus"